Clinical trial inclusion criterion:
diagnosis with mantle cell lymphoma

Annotated entities:
- Condition: "mantle cell lymphoma"